La degradación del ácido fitánico:
1. Se lleva a cabo en el hígado por βoxidación.
2. Genera propionil-CoA.
3. Requiere de la acetoacetato descarboxilasa.
4. Desencadena la enfermedad de Refsum.

Respuesta correcta: 2. Genera propionil-CoA.